Clinical trial exclusion criterion:
BCVA over 77 letters between screening and Day 0

Entity relations:
- Has_value("BCVA", "over 77 letters")